Clinical trial exclusion criterion:
Major psychiatric disorder that is not adequately controlled by treatment

Annotated entities:
- Condition: "psychiatric disorder"
- Qualifier: "Major"
- Qualifier: "adequately controlled"
- Negation: "not"